El Mini Nutricional Assessment (MNA):
1. Está indicado para mayores que viven en la comunidad pero no para pacientes hospitalizados.
2. Está validado específicamente para personas mayores.
3. Consta de ítems antropométricos, bioquímicos y dietéticos.
4. Es una herramienta fiable pero compleja de cribado nutricional.
5. Está formulado en torno a 10 ítems referidos exclusivamente a parámetros dietéticos y antropométricos.

Respuesta correcta: 2. Está validado específicamente para personas mayores.